Señale cuál de las siguientes opciones NO supone una respuesta normal del desarrollo motor del niño en su primer año de vida:
1. Hacia los 3 meses, es capaz de sostener la cabeza cuando se le incorpora.
2. Hacia los 4 meses, el tronco empieza a enderezarse aunque el equilibrio es todavía inmaduro.
3. Hacia los 8 meses, domina la posición de sentado y libera sus manos para sostener objetos manteniendo el equilibrio.
4. Hacia los 10 meses, inicia algunos pasos.
5. Hacia los 12 meses, aparece el acto de correr.

Respuesta correcta: 5. Hacia los 12 meses, aparece el acto de correr.